某藥廠宣稱：在接受該藥廠所研發新藥治療的 2000 名咽喉炎病人當中，在四天的療程後，有 94%的病人症狀獲得緩解。因此該藥廠宣稱此新藥是具有療效的，藥廠這樣的說法是：
A. 正確的
B. 不正確的，因為利用比率進行統計
C. 不正確的，因為未進行統計顯著性的檢定
D. 不正確的，因為未使用對照組

正確答案：D. 不正確的，因為未使用對照組